Clinical trial exclusion criterion:
Patients with diabetes mellitus (either primary or secondary to thalassemia).

Annotated entities:
- Condition: "diabetes mellitus"
- Qualifier: "primary"
- Qualifier: "secondary to thalassemia"